Ovarian cancer, adrenal gland tumor, endometrial cancer, cervical cancer, breast cancer

The above is a clinical trial exclusion criterion. Annotated with entity spans:
[Condition: Ovarian cancer], [Condition: adrenal gland tumor], [Condition: endometrial cancer], [Condition: cervical cancer], [Condition: breast cancer]